Clinical trial exclusion criterion:
Receipt of live-virus vaccines within 28 days prior to the initiation of study treatment or need for live-virus vaccines at any time during study treatment.

Entity relations:
- Has_index("any time during", "study treatment")
- Has_temporal("live-virus vaccines", "any time during")
- AND("live-virus vaccines", "need for")
- Has_temporal("live-virus vaccines", "within 28 days prior")
- Has_index("within 28 days prior", "the initiation of study treatment")
- OR("live-virus vaccines", "live-virus vaccines")